Concurrent medication limiting validity of neuropsychological tests or imaging.

The above is a clinical trial exclusion criterion. Annotated with entity spans:
[Temporal: Concurrent] [Drug: medication] [Qualifier: limiting validity of neuropsychological tests] or imaging.